Clinical trial exclusion criterion:
Medical history of personal drug or alcohol addiction or abuse

Entity relations:
- Has_qualifier("addiction", "drug")
- OR("drug", "alcohol")
- OR("addiction", "abuse")